Clinical trial exclusion criterion:
Stroke when meeting criteria for total anterior, partial anterior or posterior circulation infarct according to the Oxford Community Stroke Project classification. Patients with clinically silent of lacunar strokes and transient ischemic attacks will not be excluded.

Entity relations:
- Has_qualifier("circulation infarct", "total anterior")
- AND("Oxford Community Stroke Project classification", "circulation infarct")
- AND("Stroke", "Oxford Community Stroke Project classification")
- OR("total anterior", "partial anterior", "posterior")